Clinical trial exclusion criterion:
Malignant hypertension

Annotated entities:
- Condition: "Malignant hypertension"